有一 40 歲婦女因甲狀腺癌接受全甲狀腺切除術，術後 2 天發生手腳抽筋現象，則下列何種血液檢查最符合此病人之狀況？
A. free T4 0.1 ng/dL，TSH 30 µU/mL ，Na 140 mM，K 4.0 mM，Ca 2.4 mM，P 3.5 mM
B. free T4 0.8 ng/dL，TSH 2.0 µU/mL ，Na 135 mM，K 4.0 mM，Ca 1.7 mM，P 6.0 mM
C. free T4 0.8 ng/dL，TSH 2.0 µU/mL ，Na 140 mM，K 2.0 mM，Ca 2.4 mM，P 3.5 mM
D. free T4 0.6 ng/dL，TSH 4.0 µU/mL ，Na 120 mM，K 4.0 mM，Ca 2.4 mM，P 6.0 mM

正確答案：B. free T4 0.8 ng/dL，TSH 2.0 µU/mL ，Na 135 mM，K 4.0 mM，Ca 1.7 mM，P 6.0 mM